下列各項有關「休克」（shock）的敘述，何者錯誤？
A. 收縮壓開始下降時，表示出血量已達體內血液量的 30%
B. 神經性休克（neurogenic shock）常伴隨脈搏壓（pulse pressure）下降
C. 出血程度是以理想體重百分比計算之
D. 小兒血量之計算標準是每公斤 80 mL 到 90 mL

正確答案：B. 神經性休克（neurogenic shock）常伴隨脈搏壓（pulse pressure）下降